對於紅血球細胞骨架血影蛋白（Cytoskeleton spectrin）缺陷之遺傳疾病病人，臨床研究顯示脾臟切除可以改善這些病人的慢性貧血症狀。此種脾臟切除臨床改善的功效最可能的機制為何？
A. 紅血球變形能力增加
B. 紅血球的調理作用（Opsonization）減少，因而被破壞移除就較少
C. 紅血球在脾臟貯存及破壞的數量減少
D. 活性氧（Reactive oxygen species）的產生量減少

正確答案：C. 紅血球在脾臟貯存及破壞的數量減少